Clinical trial exclusion criterion:
Women of child bearing potential unless they are using a birth control method

Annotated entities:
- Person: "Women"
- Condition: "child bearing potential"
- Negation: "unless"
- Procedure: "birth control method"